小珊在兩天前經陰道分娩一名女嬰，過程順利、陰道裂傷二度，惡露量中等，她活動自如且開始嘗試哺乳；沒想到今天開始間歇性地有高燒情形（攝氏 39 度），病房護士請你過去評估她的情形。下列敘述何者正確？
A. 產褥熱（puerperal fever）通常發生在產後 24 小時內，跟支氣管塌陷（atelectasia）相關最大
B. 在過去由於預防性抗生素不普遍及無菌技術難以維持，因生殖道感染（genital tract infection）造成的產褥熱，在剖腹產孕婦比自然產更常見
C. 產褥熱的發生與種族跟社經地位相關不大
D. 子宮內膜炎（postpartum metritis）造成的產褥熱在臨床上的診斷主要是以細菌培養為主，發燒只能作為參考

正確答案：B. 在過去由於預防性抗生素不普遍及無菌技術難以維持，因生殖道感染（genital tract infection）造成的產褥熱，在剖腹產孕婦比自然產更常見